Is pregnant or lactating

The above is a clinical trial exclusion criterion. Annotated with entity spans:
[Pregnancy_considerations: Is pregnant or lactating]